Clinical trial exclusion criterion:
Contra-indication to use of GLM (Hypersensitivity to the active substance or to any of the excipients; Active tuberculosis (TB), acute or chronic Hepatitis B infection or other severe infections such as sepsis and/or opportunistic infections including HIV infection; Moderate or severe heart failure (NYHA class III/IV)

Annotated entities:
- Condition: "Contra-indication"
- Drug: "GLM"
- Condition: "Hypersensitivity"
- Drug: "active substance"
- Drug: "excipients"
- Condition: "tuberculosis (TB)"
- Temporal: "Active"
- Qualifier: "acute"
- Qualifier: "chronic"
- Condition: "Hepatitis B infection"
- Condition: "severe infections"
- Condition: "sepsis"
- Condition: "opportunistic infections"
- Condition: "HIV infection"
- Qualifier: "Moderate"
- Qualifier: "severe"
- Condition: "heart failure"
- Measurement: "NYHA"
- Value: "class III/IV"